Which genes does thyroid hormone receptor alpha1 regulate in the liver?

phosphoenolpyruvate-carboxykinase"//
"pyruvate kinase"//
"D1", "deiodinase 1"//